Mental illness, mental retardation, or inability to participate in informed consent due to mental status

The above is a clinical trial exclusion criterion. Annotated with entity spans:
[Condition: Mental illness], [Condition: mental retardation], or [Condition: inability to participate in informed consent] due to [Condition: mental status]